Associated neuromuscular disorders, contraindication for the use of rocuronium/ sugammadex, allergy or hypersensitivity to rocuronium / sugammadex

The above is a clinical trial exclusion criterion. Annotated with entity spans:
Associated [Condition: neuromuscular disorders], [Condition: contraindication] for the use of [Drug: rocuronium]/ [Drug: sugammadex], [Condition: allergy] or [Condition: hypersensitivity] to [Drug: rocuronium] / [Drug: sugammadex]